Clinical trial exclusion criterion:
Structural brain abnormalities on any prior imaging with associated clinically evident manifestations

Annotated entities:
- Condition: "Structural brain abnormalities"
- Procedure: "imaging"
- Temporal: "prior"
- Qualifier: "any"
- Qualifier: "clinically evident"
- Condition: "manifestations"